關於雙極性疾患（bipolar disorder）治療藥物之敘述，下列何者錯誤？
A. lithium 在懷孕婦女身上所造成畸胎性，最常見 Ebstein 氏三尖瓣膜異常症（Ebstein's anomaly）
B. valproate 在懷孕婦女身上所造成的畸胎性，最常見為膽道閉鎖（biliary atresia）
C. lamotrigine 可能引起毒性表皮壞死溶解症（toxic epidermal necrolysis）
D. carbamazepine 可能會引起史帝芬強生症候群（Stevens-Johnson syndrome）

正確答案：B. valproate 在懷孕婦女身上所造成的畸胎性，最常見為膽道閉鎖（biliary atresia）